一位車禍病患被送進急診室，主訴胸痛、呼吸困難、血壓 80/45 mmHg，心跳 120 次/min，X-ray 發現右肺野不清楚，縱膈腔偏左側，此時最佳的處理方法為何？
A. 立刻做電腦斷層
B. 立刻置放氣管內插管並予鎮靜
C. 給予靜脈輸液後，若有血胸則置入胸管
D. 懷疑有肋膜腔積血（hemothorax）時，最可能原因為肺撕裂傷

正確答案：C. 給予靜脈輸液後，若有血胸則置入胸管